王小弟因為氣喘及反覆性細菌性肺炎，生長發育不良，經sweat chloride test而被診斷為囊腫纖維症（cystic fibrosis）。這是一種自體隱性遺傳性疾病，王家子女將有3/4機率是帶因或罹病者，這對夫婦於是希望另外兩個目前沒有症狀的7歲與10歲子女接受帶因者基因檢測。下列醫療的建議何者最正確？
A. 及早診斷隱藏罹病者可以改善疾病預後
B. 及早發現攜帶基因有助於兒童心理調適
C. 帶因者基因檢測應該經雙方家族會議後決定
D. 待子女成年後，由他們自己決定是否接受帶因者基因檢測

正確答案：D. 待子女成年後，由他們自己決定是否接受帶因者基因檢測